At least one of the knee pain VAS score is 40mm or more.

The above is a clinical trial inclusion criterion. Annotated with entity spans:
[Multiplier: At least one] of the [Condition: knee pain] [Measurement: VAS score] is [Value: 40mm or more].